Clinical trial exclusion criterion:
Patients who are medically unstable, patients who are seriously or terminally ill, and patients whose clinical course is unpredictable. For example:

Annotated entities:
- Condition: "medically unstable"
- Condition: "seriously ill"
- Condition: "terminally ill"
- Condition: "clinical course is unpredictable"